Clinical trial inclusion criterion:
Women of child-bearing potential and men must agree to use 2 forms of adequate contraception prior to study entry and for the duration of study participation

Annotated entities:
- Condition: "child-bearing potential"
- Person: "Women"
- Person: "men"
- Mood: "must agree to"
- Multiplier: "2 forms"
- Procedure: "contraception"
- Qualifier: "adequate"
- Temporal: "prior to study entry"
- Temporal: "for the duration of study participation"
- Reference_point: "study participation"
- Reference_point: "study entry"